Clinical trial exclusion criterion:
mRS before the autoimmune encephalitis > 3

Entity relations:
- Has_index("before the autoimmune encephalitis", "the autoimmune encephalitis")
- multi("the autoimmune encephalitis", "autoimmune encephalitis")
- Has_value("mRS", "> 3")
- Has_temporal("mRS", "before the autoimmune encephalitis")